Clinical trial exclusion criterion:
Any clinically significant abnormality or medical history or physical examination including history of immunodeficiency or autoimmune disease (in addition to HCV infection, for HCV group)

Entity relations:
- Has_negation("HCV infection", "in addition to")
- OR("immunodeficiency", "autoimmune disease")